Clinical trial exclusion criterion:
12. Chronic heart failure complicated with acute hemodynamic disturbance or acute decompensation within last 1 month;

Entity relations:
- AND("Chronic heart failure", "acute hemodynamic disturbance")
- Has_temporal("Chronic heart failure", "within last 1 month")
- OR("acute hemodynamic disturbance", "acute decompensation")